A bad reaction to AZD5363 or any drugs similar to it in structure or class

The above is a clinical trial exclusion criterion. Annotated with entity spans:
[Context_Error: A bad reaction to AZD5363 or any drugs similar to it in structure or class]